下列何種自體抗體在全身性紅斑狼瘡（systemic lupus erythematosus）患者具有診斷上的意義，並且和疾病活動性（尤其是腎炎）有關？
A. 抗雙鏈 DNA 抗體（anti-double-stranded DNA antibody）
B. 抗核抗體（antinuclear antibody）
C. 抗 Sm 抗體（anti-Smith antibody）
D. 抗組織蛋白抗體（antihistone antibody）

正確答案：A. 抗雙鏈 DNA 抗體（anti-double-stranded DNA antibody）